Clinical trial inclusion criterion:
Have normal screening laboratories for white blood cells (WBC), hemoglobin (Hgb), platelets, sodium, potassium, chloride, bicarbonate, blood urea nitrogen (BUN), creatinine, ALT (liver function), AST (liver function) and bilirubin

Annotated entities:
- Value: "normal"
- Measurement: "white blood cells"
- Measurement: "WBC"
- Measurement: "hemoglobin"
- Measurement: "Hgb"
- Measurement: "platelets"
- Measurement: "sodium"
- Measurement: "potassium"
- Measurement: "chloride"
- Measurement: "bicarbonate"
- Measurement: "blood urea nitrogen"
- Measurement: "BUN"
- Measurement: "creatinine"
- Measurement: "ALT"
- Measurement: "AST"
- Measurement: "bilirubin"